Clinical trial exclusion criterion:
History of severe related adverse event(s) from previous participation in VA-001 or VA-006 trials or to any smallpox vaccination.

Entity relations:
- AND("adverse event", "smallpox vaccination")